La teoría de “la incubación de la ansiedad” de H.J. Eysenck, trata de explicar, sobre todo, los factores:
1. Precipitantes de la ansiedad.
2. Predisponentes a la ansiedad.
3. De mantenimientos de la ansiedad.
4. Fisiológicos de la ansiedad.
5. Ambientales de la ansiedad.

Respuesta correcta: 3. De mantenimientos de la ansiedad.